某陽離子在細胞外之濃度遠高於其在細胞內之濃度，當一神經細胞之細胞膜對此陽離子之通透度遠大於對其他離子之通透度時，細胞膜電位最可能為何？
A. 零
B. 負電位
C. 正電位
D. 無法判斷

正確答案：C. 正電位